Renal impairment (AKIN stage = 1) or acute and/or chronic renal replacement therapy

The above is a clinical trial inclusion criterion. Annotated with entity spans:
[Condition: Renal impairment] ([Measurement: AKIN stage] [Value: = 1]) or [Qualifier: acute] and/or [Qualifier: chronic] [Procedure: renal replacement therapy]